Clinical trial exclusion criterion:
Previous serious adverse event or hypersensitivity to cannabis or cannabinoids

Entity relations:
- AND("hypersensitivity", "cannabis")
- Has_qualifier("adverse event", "serious")
- OR("cannabis", "cannabinoids")
- OR("adverse event", "hypersensitivity")